Clinical trial exclusion criterion:
More than 4 previous embryo transfers

Annotated entities:
- Multiplier: "More than 4"
- Temporal: "previous"
- Procedure: "embryo transfers"